Clinical trial exclusion criterion:
Fibrinolytics within 24 hours

Annotated entities:
- Procedure: "Fibrinolytics"
- Temporal: "within 24 hours"